有關肝臟之組織，下列何者錯誤？
A. 肝細胞中的脂蛋白複體（lipoprotein complex）在電鏡下呈密心小泡（dense-cored vesicle）形態
B. 肝細胞脂蛋白複體（lipoprotein complex）的脂質部分是由平滑內質網產生，蛋白質部分由粗糙內質網產生
C. 供應肝之血液循環不良時，肝門管小葉第一區（zone 1 of liver acinus）的細胞最先死亡且最後再生
D. 對毒物及膽汁淤滯（bile stasis）最慢反應的細胞是位於肝門管小葉第三區（zone 3 of liver acinus）

正確答案：C. 供應肝之血液循環不良時，肝門管小葉第一區（zone 1 of liver acinus）的細胞最先死亡且最後再生